Willing to have buccal administration of misoprostol or a placebo at least one hour pre-procedure.

The above is a clinical trial inclusion criterion. Annotated with entity spans:
[Mood: Willing to have] [Procedure: buccal administration] of [Drug: misoprostol] or a [Drug: placebo] [Temporal: at least one hour pre-procedure].